¿Cuál de las siguientes circunstancias NO define a un paciente con pluripatología crónica?
1. Mujer de 66 años diagnosticada de HTA, enfermedad de Crohn, diabetes mellitus tipo 2 con retinopatía diabética.
2. Mujer de 75 años exfumadora, FEV1 75 %, IMC 25, creatinina 1,2, síndrome ansiosodepresivo. Pfeiffer 30 y Barthel 100.
3. Hombre de 82 años de edad diagnosticado de artrosis, con Barthel 40, HTA y dislipemia controladas farmacológicamente y enfermedad de Alzheimer.
4. Hombre de 55 años de edad exfumador, diagnosticado de arteriopatía periférica sintomática y colitis ulcerosa.
5. Hombre de 70 años de edad con enolismo, hipertensión portal e inmovilizado en domicilio desde hace 5 años por ACV.

Respuesta correcta: 2. Mujer de 75 años exfumadora, FEV1 75 %, IMC 25, creatinina 1,2, síndrome ansiosodepresivo. Pfeiffer 30 y Barthel 100.